Clinical trial inclusion criterion:
4. Disease severity level: Gross Motor Function Classification System (GMFCS) levels I, II and III.

Entity relations:
- Has_value("Gross Motor Function Classification System (GMFCS)", "levels I, II and III")